關於遠端肱骨骨折（distal humeral fracture）之敘述，下列何者錯誤？
A. 健康成年人的移位性遠端肱骨的關節內骨折（displaced distal humeral intra-articular fracture）採用保守治療，其功能預後（functional outcome）不佳，故目前多建議手術治療
B. 若使用後側入路（posterior approach）進行手術治療時，不需例行性地找出並保護尺神經（ulnar nerve）
C. 對於較複雜的骨折，除了使用X光檢查之外，可輔以三度空間重建的電腦斷層掃描（computerized tomography with three-dimensional reconstruction）協助判讀骨折型態
D. 對健康情況不良的老年人而言，若對於肘關節的功能需求不高時，則不論其遠端肱骨骨折的型態為何，皆可考慮保守治療

正確答案：B. 若使用後側入路（posterior approach）進行手術治療時，不需例行性地找出並保護尺神經（ulnar nerve）